Patients who can not tolerate apatinib treatment as judged by the investigator depending on the their medical history;

The above is a clinical trial exclusion criterion. Annotated with entity spans:
Patients who can [Negation: not] [Condition: tolerate] [Drug: apatinib] treatment as judged by the investigator depending on the their medical history;